有位研究員想要利用幾個焦點團體發展「問題少女與父母間關係」的問卷。研究者規劃時應考慮受試者權益的倫理議題不包括下列何者？
A. 所給補償費的金額大小，是否符合正義原則
B. 研究的樣本大小
C. 何人參與焦點團體的保密措施
D. 會談中敏感話題可能造成的情緒低落

正確答案：B. 研究的樣本大小